can operate patient-controlled analgesia (PCA) machine

The above is a clinical trial inclusion criterion. Annotated with entity spans:
[Non-query-able: can operate patient-controlled analgesia (PCA) machine]